Clinical trial exclusion criterion:
Fetal destress or gestational age < 36 week

Entity relations:
- Has_value("gestational age", "< 36 week")
- OR("Fetal destress", "gestational age")